有關縱膈腔腫瘤的敘述，下列何者錯誤？
A. 若腫瘤是後縱膈的神經性腫瘤（neurogenic tumor），則最可能是神經鞘瘤（schwannoma）
B. 胸腺瘤（thymoma）最常見的合併全身性疾病為重症肌無力（myasthenia gravis）
C. 於電腦斷層攝影（CT scan）發現前縱膈腔腫瘤為 cystic and fatty density，有鈣化，則最可能是畸胎瘤（teratoma）
D. 若前縱膈的腫瘤經切片確定為原發性非生殖細胞瘤（primary nonseminoma），則第一線為手術治療，術後再行化學治療及放射治療

正確答案：D. 若前縱膈的腫瘤經切片確定為原發性非生殖細胞瘤（primary nonseminoma），則第一線為手術治療，術後再行化學治療及放射治療